Clinical trial exclusion criterion:
Patients with a personal situation judged by the investigator as unlikely to be compatible with optimal participation in the study, or which could constitute a risk for the patient.

Entity relations:
- OR("judged by the investigator as unlikely to be compatible with optimal participation in the study", "could constitute a risk for the patient")